Subject is at least 18 and not older than 75years old.

The above is a clinical trial inclusion criterion. Annotated with entity spans:
Subject is [Value: at least 18 and not older than 75years] [Person: old].